Clinical trial inclusion criterion:
Previous intolerance to kava

Annotated entities:
- Condition: "intolerance"
- Drug: "kava"
- Temporal: "Previous"